Clinical trial inclusion criterion:
Provided informed consent.

Annotated entities:
- Non-query-able: "Provided informed consent."